If immunodepression is present

The above is a clinical trial exclusion criterion. Annotated with entity spans:
If [Condition: immunodepression] is present